Clinical trial exclusion criterion:
Refusal to give consent to participate in the trial

Annotated entities:
- Informed_consent: "Refusal to give consent to participate in the trial"